What disease is associated with a Malar rash?

Malar rash is a systemic lupus erythematosus (SLE) syndrome characterized by cutaneous manifestions (contact dermatitis, pompholyx, hand dermatitis dyshydrosis, urticaria) with chronic course and chronic course.